Indique las unidades correctas de una constante de velocidad de orden cero:
1. mg-1.
2. h-1.
3. mg/h.
4. g X h/mL.
5. mL/h.

Respuesta correcta: 3. mg/h.